Clinical trial exclusion criterion:
Meet one or more of the contraindications for MRI including Psychiatric disorders, anxiety, claustrophobia Cardiac disorders that represent a contraindication to MRI

Annotated entities:
- Multiplier: "one or more"
- Condition: "contraindications"
- Procedure: "MRI"
- Condition: "Psychiatric disorders"
- Condition: "anxiety"
- Condition: "claustrophobia"
- Condition: "Cardiac disorders"
- Condition: "contraindication"
- Procedure: "MRI"